Clinical trial exclusion criterion:
Latent tuberculosis unless effective anti-tuberculosis therapy has been completed, or active tuberculosis.

Annotated entities:
- Condition: "Latent tuberculosis"
- Negation: "unless"
- Procedure: "anti-tuberculosis therapy"
- Qualifier: "completed"
- Condition: "active tuberculosis"